Clinical trial exclusion criterion:
Single shot local nerve block prior to surgery was ineffective

Annotated entities:
- Multiplier: "Single shot"
- Procedure: "local nerve block"
- Temporal: "prior to surgery"
- Reference_point: "surgery"